Clinical trial exclusion criterion:
Inability to attend follow up visits

Annotated entities:
- Condition: "Inability"
- Observation: "attend follow up visits"